No narcotic before surgery as premedication

The above is a clinical trial inclusion criterion. Annotated with entity spans:
[Negation: No] [Drug: narcotic] [Temporal: before surgery] as premedication